Clinical trial inclusion criterion:
No other melanoma treatment during the protocol.

Entity relations:
- causal("treatment", "melanoma")
- Has_temporal("treatment", "during the protocol")